Has planned release from the Canadian Armed Forces within one year;

The above is a clinical trial exclusion criterion. Annotated with entity spans:
Has planned [Observation: release from the Canadian Armed Forces] [Temporal: within one year];